Los enlaces por puente disulfuro de las proteínas:
1. Se rompen fácilmente con urea 8M.
2. Los rompe el tratamiento con betamercaptoetano.
3. Mantienen la estructura primaria de las proteínas globulares.
4. El tratamiento por diálisis provoca su ruptura.

Respuesta correcta: 2. Los rompe el tratamiento con betamercaptoetano.